前列腺肥大病患接受經尿道前列腺切除手術時，出現意識迷糊、噁心、高血壓、心跳變慢等症狀，其最可能之原因是：
A. 血症（sepsis）
B. 出血性休克（hemorrhagic shock）
C. 深部靜脈血栓（deep vein thrombosis）
D. 經尿道切除症候群（transurethral resection syndrome）

正確答案：D. 經尿道切除症候群（transurethral resection syndrome）